La región promotora de un gen es:
1. El lugar de finalización de la transcripción.
2. El lugar de unión de la RNA polimerasa durante el inicio de la síntesis de mRNA.
3. El lugar de reconocimiento para procesar transcritos primarios.
4. Una secuencia localizada en la región 5' de todos los mRNAs para iniciar la traducción.
5. Una secuencia que se elimina durante el corte y empalme del RNA.

Respuesta correcta: 2. El lugar de unión de la RNA polimerasa durante el inicio de la síntesis de mRNA.